Women with confirmed or suspected pregnancy

The above is a clinical trial exclusion criterion. Annotated with entity spans:
[Person: Women] with [Qualifier: confirmed] or [Qualifier: suspected] [Condition: pregnancy]